Clinical trial exclusion criterion:
history of asthma, acute rhinitis, nasal polyps, angioedema, urticaria or allergic reactions to aspirin or other non-steroidal anti-inflammatory drugs(including COX-2 inhibitors).

Entity relations:
- Subsumes("non-steroidal anti-inflammatory drugs", "COX-2 inhibitors")
- Has_qualifier("non-steroidal anti-inflammatory drugs", "other")
- AND("allergic reactions", "aspirin")
- OR("aspirin", "non-steroidal anti-inflammatory drugs")
- OR("asthma", "allergic reactions", "angioedema", "nasal polyps", "acute rhinitis", "urticaria")